下列何種病毒最容易在游泳池中造成眼部感染，引起結膜炎？
A. 乳突瘤病毒（Human papilloma virus）
B. 單純疤疹病毒（Herpes simplex virus）
C. 腺病毒（Adenovirus）
D. 痘病毒（Poxvirus）

正確答案：C. 腺病毒（Adenovirus）